immunization with PPV23 within the last year

The above is a clinical trial exclusion criterion. Annotated with entity spans:
[Procedure: immunization] with [Drug: PPV23] [Temporal: within the last year]